使用病人自控式止痛術（patient-controlled analgesia）控制手術後疼痛和傳統肌肉注射比較，其優點包括下列各項，除了：
A. 提供較佳的止痛效果
B. 病患滿意度較高
C. 任何病患皆可使用
D. 病人可依疼痛強度調整止痛藥劑量

正確答案：C. 任何病患皆可使用